Cohort 1: Recurrent or refractory medulloblastoma in which current standard treatment approaches have failed; biopsy is not required for recurrent disease.

The above is a clinical trial inclusion criterion. Annotated with entity spans:
Cohort 1: [Condition: Recurrent] or [Condition: refractory medulloblastoma] in which current [Procedure: standard treatment] approaches have [Qualifier: failed]; biopsy is [Mood: not required] for recurrent disease.